Clinical trial inclusion criteria:
At least 18 years of age
Signed informed consent
African American race
History of a solitary renal transplant
Stable tacrolimus dose for at least 2 weeks prior to randomization

Annotated entities:
- Person: "age"
- Value: "At least 18 years"
- Post-eligibility: "Signed informed consent"
- Person: "race"
- Value: "African American"
- Procedure: "renal transplant"
- Qualifier: "solitary"
- Drug: "tacrolimus"
- Temporal: "for at least 2 weeks prior to randomization"
- Reference_point: "randomization"
- Qualifier: "Stable dose"